Clinical trial inclusion criterion:
Pregnant women with abdomen discumfort and ultrasound diagnosis of polyhydramnios (AFI>25cm)

Entity relations:
- Has_value("AFI", ">25cm")
- Has_value("ultrasound", "diagnosis")
- AND("polyhydramnios", "ultrasound")
- Subsumes("ultrasound", "AFI")